Clinical trial exclusion criterion:
cervix flushed with the vagina.

Annotated entities:
- Condition: "cervix flushed with the vagina"